Clinical trial inclusion criteria:
Male or female subjects aged =18 to =65 years
General good health as established by medical history and physical examination
Written informed consent
Females of childbearing potential must agree to use an efficacious hormonal or barrier method of birth control during the study. Abstinence is acceptable.
Available for all visits scheduled in this study.

Annotated entities:
- Person: "Male"
- Person: "female"
- Person: "aged"
- Value: "=18 to =65 years"
- Condition: "General good health"
- Qualifier: "established by medical history"
- Procedure: "physical examination"
- Observation: "Written informed consent"
- Person: "Females"
- Observation: "childbearing potential"
- Mood: "agree to use"
- Qualifier: "efficacious"
- Qualifier: "hormonal method"
- Qualifier: "barrier method"
- Procedure: "birth control"
- Temporal: "during the study"
- Observation: "Abstinence"
- Observation: "Available for all visits"
- Qualifier: "scheduled in this study"